下列何者為 Nitrofurantoin 主要之副作用？
A. 噁心
B. 耳聾
C. 腎功能不全
D. 抽搐（seizure）

正確答案：A. 噁心